8. Subjects who plan to have cardiac transplantation;

The above is a clinical trial exclusion criterion. Annotated with entity spans:
8. Subjects who [Mood: plan] to have [Procedure: cardiac transplantation];